Clinical trial inclusion criterion:
adult patients aged = 55 years with

Entity relations:
- Has_value("aged", "= 55 years")